下列何者非主動脈瓣閉鎖不全（aortic regurgitation）的身體診查所見？
A. Corrigan's pulse
B. de Musset's sign
C. elevated diastolic BP
D. Austin Flint murmur

正確答案：C. elevated diastolic BP